Clinical trial inclusion criterion:
2. One cycle of intermittent therapy up to a maximum exposure of 10 months.

Entity relations:
- Has_multiplier("intermittent therapy", "One cycle")
- Has_value("maximum exposure", "10 months")
- AND("intermittent therapy", "maximum exposure")